Clinical trial inclusion criterion:
Grade 0 finger/thumb extension at 6 months

Entity relations:
- Has_qualifier("extension", "finger")
- Has_value("extension", "Grade 0")
- Has_temporal("extension", "at 6 months")
- OR("finger", "thumb")